Clinical trial exclusion criterion:
AST or ALT >350 within 6 months prior to enrollment

Entity relations:
- Has_index("within 6 months prior to enrollment", "enrollment")
- Has_value("AST", ">350")
- Has_temporal("AST", "within 6 months prior to enrollment")
- OR("AST", "ALT")